Respecto de la vitamina B12 ¿qué opción considera correcta?:
1. Su principal fuente para el organismo es la ingesta de frutas y verduras.
2. Sus depósitos se localizan en el hígado.
3. Se conjuga en el íleon con el factor intrínseco.
4. Su déficit conduce a reducción de los niveles de homocisteína en plasma.

Respuesta correcta: 2. Sus depósitos se localizan en el hígado.